Acute or infectious inflammatory disease

The above is a clinical trial exclusion criterion. Annotated with entity spans:
[Qualifier: Acute] or [Qualifier: infectious] [Condition: inflammatory disease]